patients received doxorubicin therapy, total cumulative dose of adriamycin was more than 300 mg/m2, total cumulative dose of epirubicin was more than 450 mg/m2;

The above is a clinical trial exclusion criterion. Annotated with entity spans:
patients received [Drug: doxorubicin] therapy, [Qualifier: total cumulative dose] of [Drug: adriamycin] was [Multiplier: more than 300 mg/m2], [Qualifier: total cumulative dose] of [Drug: epirubicin] was [Multiplier: more than 450 mg/m2];